60歲男性，主述長期咳痰，呼吸不暢，最近有關節痠痛症狀。身體檢查時看到杵狀指 （clubbing fingers）。下列那些疾病應優先列入鑑別診斷？①肺癌 ②急性肺炎 ③支氣管擴張症 ④先天性心臟病 ⑤肝硬化 ⑥克隆氏症（Crohn's disease）
A. ①②③④⑤⑥
B. 僅③④⑤⑥
C. 僅②④⑤⑥
D. 僅①③⑤

正確答案：D. 僅①③⑤